Una mujer se presenta en la consulta con su hija de 3 años porque le ha detectado ligero desarrollo mamario desde hace 3 meses sin tomar medicación alguna ni objetivarse antecedentes relevantes en la historia. Efectivamente, el examen físico muestra un estadio Tanner IV, sin crecimiento del vello púbico o axilar. Los genitales externos son normales. La ecografía revela un pequeño útero y la radiología una edad ósea de 3 años. ¿Qué actitud se debería adoptar?
1. Seguimiento cada 3-4 meses, ya que se trata de una condición temporal que a menudo se resuelve sola.
2. Biopsia mamaria.
3. Mamografía.
4. Administración de análogos GnRh.

Respuesta correcta: 1. Seguimiento cada 3-4 meses, ya que se trata de una condición temporal que a menudo se resuelve sola.